Clinical trial exclusion criterion:
Rest pain or tissue loss due to PAD (Fontaine stage III and IV),

Entity relations:
- Has_value("Fontaine stage", "III")
- AND("Rest pain", "PAD")
- AND("Rest pain", "Fontaine stage")
- OR("III", "IV")
- OR("Rest pain", "tissue loss")